Clinical trial exclusion criterion:
A known allergy to Celecoxib, aspirin or another NSAID.

Annotated entities:
- Condition: "allergy"
- Drug: "Celecoxib"
- Drug: "aspirin"
- Drug: "NSAID"
- Qualifier: "another"